下列何者並沒有參與瞳孔對光的反射作用？
A. Iris
B. Parasympathetic nerve
C. Medial geniculate body
D. Ciliary ganglion 3 	Unmyelinated C fibers 主要與下列何者感覺有關？

正確答案：C. Medial geniculate body